Clinical trial inclusion criterion:
Generally healthy, postmenopausal woman who seeks treatment for hot flushes.

Annotated entities:
- Condition: "healthy"
- Condition: "postmenopausal"
- Person: "woman"
- Condition: "hot flushes"